Clinical trial inclusion criterion:
Male or female, aged = 18 to = 60 years on day of inclusion.

Entity relations:
- Has_value("aged", "= 18 to = 60 years")
- Has_temporal("= 18 to = 60 years", "on day of inclusion")
- OR("Male", "female")